腎結石有多種，最常見的是那一類？
A. cystine stones
B. 含鈣石（calcium stones）
C. struvite stones
D. 尿酸石（uric acid stones）

正確答案：B. 含鈣石（calcium stones）